TB screening: chest X-Ray unless performed in the last 6 months

The above is a clinical trial inclusion criterion. Annotated with entity spans:
[Procedure: TB screening]: [Procedure: chest X-Ray] unless performed in the last 6 months